急診醫師被通知健保核刪到院前死亡的病人急救過程中的CPR和氣管插管。下列敘述何者正確？
A. 到院前死亡的病人不需要CPR和氣管插管，健保核刪為合理
B. 到院前死亡的病人一定要CPR和氣管插管，健保核刪不合理
C. 急診醫師應依其臨床判斷決定是否需要CPR和氣管插管。健保核刪應據理力爭
D. 依醫院規定，決定是否對到院前死亡的病人急救

正確答案：C. 急診醫師應依其臨床判斷決定是否需要CPR和氣管插管。健保核刪應據理力爭